Autoimmune Hemolytic anemia with clinical and biochemical evidence of hemolysis refractory to treatment, in relapse or steroids dependant

The above is a clinical trial inclusion criterion. Annotated with entity spans:
[Condition: Autoimmune Hemolytic anemia] with clinical and [Mood: biochemical evidence] of [Condition: hemolysis] [Qualifier: refractory to treatment], [Qualifier: in relapse] or [Qualifier: steroids dependant]